Clinical trial exclusion criterion:
obesity - BMI (body mass index) >30 kg/m2

Annotated entities:
- Condition: "obesity"
- Measurement: "BMI"
- Measurement: "body mass index"
- Value: ">30 kg/m2"